Clinical trial exclusion criterion:
Past or present hepatitis B infection (positive hepatitis B serology)

Entity relations:
- Has_value("hepatitis B serology", "positive")
- AND("hepatitis B infection", "hepatitis B serology")